Clinical trial exclusion criterion:
Has contact lens best corrected distance vision worse than 20/25 (0.10 logMAR) in either eye.

Entity relations:
- Subsumes("worse than 20/25 in either eye", "worse than 0.10 logMAR in either eye")
- Has_value("contact lens best corrected distance vision", "worse than 20/25 in either eye")